王媽媽的左手中指在彎曲及伸直的交替動作中，肌腱在掌指關節處基部摸到結節（nodule），且有時會產生聲響，影響手指活動，王媽媽得了什麼疾病 ?
A. 鎚狀指（mallet finger）
B. 扳機指（trigger finger）
C. 狹窄性肌腱滑膜炎（de Quervain tenosynovitis）
D. 手部鈕扣畸形（bontonniere deformity）

正確答案：B. 扳機指（trigger finger）